Clinical trial inclusion criterion:
Hypertension

Annotated entities:
- Condition: "Hypertension"